Clinical trial inclusion criterion:
Known or suspected clinically unstable systemic medical disorder

Annotated entities:
- Qualifier: "clinically unstable"
- Qualifier: "systemic"
- Condition: "medical disorder"
- Mood: "suspected"
- Mood: "Known"